Clinical trial inclusion criterion:
Female patients older than 18 years.

Annotated entities:
- Person: "Female"
- Value: "older than 18 years"
- Person: "years"